Si un paciente dice oír voces en París cuando él se encuentra en Londres, decimos que padece:
1. Una alucinación refleja.
2. Una alucinación paranoide.
3. Una alucinación extracampina.
4. Una alucinación autoscópica.
5. Una alucinación negativa.

Respuesta correcta: 3. Una alucinación extracampina.